With contraindication to receive adjuvant chemotherapy.

The above is a clinical trial exclusion criterion. Annotated with entity spans:
With [Condition: contraindication] to receive [Procedure: adjuvant chemotherapy].